阻塞性睡眠呼吸停止症候群在臨床表現上除了容易打鼾外，不會有下列何種表現？
A. 晚上不易入睡
B. 白天過度嗜睡
C. 中度以上肥胖
D. 輕度至中度高血壓

正確答案：A. 晚上不易入睡